Presence (i.e., above the ULN) of anti-thyroid stimulating hormone receptor antibodies (anti-TSHR) and anti-thyroid peroxidase antibody (anti-TPO)

The above is a clinical trial exclusion criterion. Annotated with entity spans:
[Value: Presence] (i.e., [Value: above the ULN]) of [Measurement: anti-thyroid stimulating hormone receptor antibodies (anti-TSHR)] and [Measurement: anti-thyroid peroxidase antibody (anti-TPO)]